J. C. de 85 años, tiene antecedentes de osteoporosis. Una potencial complicación es la fractura por fragilidad, destacando que:
1. Una importante proporción de fracturas vertebrales cursan de forma asintomática.
2. La fractura de Colles es rara en mayores de 65 años.
3. Las fracturas del tercio proximal del fémur pertrocantéreas son las fracturas de cadera menos frecuentes.
4. La mitad de los mayores que tienen una caída sufren una fractura de cadera.
5. El tratamiento de una fractura proximal de fémur siempre será el reemplazo protésico.

Respuesta correcta: 1. Una importante proporción de fracturas vertebrales cursan de forma asintomática.